Documented chronic peripheral arterial disease preventing the use of the femoral technique;

The above is a clinical trial exclusion criterion. Annotated with entity spans:
Documented [Qualifier: chronic] [Condition: peripheral arterial disease] [Negation: preventing] the use of the [Procedure: femoral technique];